Los hepatocitos en vidrio esmerilado son característicos de:
1. Hepatitis crónica por VHB.
2. Hepatitis crónica por VHC.
3. Hepatitis crónica por VH delta.
4. Hepatitis por tóxicos.
5. Hepatitis por alcohol.

Respuesta correcta: 1. Hepatitis crónica por VHB.